Clinical trial exclusion criterion:
use of pain medication prior to procedure

Annotated entities:
- Drug: "pain medication"
- Temporal: "prior to procedure"